Serum or plasma total bilirubin less than or equal to 2.5 times the upper limit of normal

The above is a clinical trial inclusion criterion. Annotated with entity spans:
[Qualifier: Serum] or [Qualifier: plasma] [Measurement: total bilirubin] [Value: less than or equal to 2.5 times the upper limit of normal]